Clinical trial inclusion criterion:
Patients must have adequate hepatic function as documented by a serum bilirubin less than or equal to 2x the institutional upper limit of normal, regardless of whether patients have liver involvement secondary to tumor. Patients may not have ascites or the ascites must be responsive to diuretics.

Annotated entities:
- Measurement: "hepatic function"
- Value: "adequate"
- Measurement: "serum bilirubin"
- Value: "less than or equal to 2x the institutional upper limit of normal"
- Condition: "ascites"
- Negation: "may not have"
- Condition: "ascites"
- Qualifier: "responsive to diuretics"